Clinical trial exclusion criteria:
Any significant acute or chronic medical illness or problem, including, but not limited to, diabetes, hypertension, cardiac disease, asthma, chronic obstructive lung disease
Current or recent (last 60 days) tobacco or nicotine use
History of sickle cell trait or disease or any other acquired or hereditary hematological abnormality
History of fainting or other significant adverse reaction during phlebotomy or donation of blood
Known prolonged QTc (or evidence of such at screening) on electrocardiogram defined as >470 ms
Known or suspected illicit drug or alcohol abuse
Known or suspected HIV, Hepatitis B, or Hepatitis C infection
History of thrombophilia or anticoagulant therapy
Pregnancy
Obesity defined as BMI>30
Recent history of blood donation: a) Single whole blood unit donation within the past 8 weeks; b) Double RBC donation by apheresis within the past 16 weeks; or c) Plasma donation by apheresis within the past 4 weeks
Inadequate RBC mass based on TBV <4500 ml (above) or screening Hb <14 g/dL

Annotated entities:
- Condition: "diabetes"
- Condition: "hypertension"
- Condition: "cardiac disease"
- Condition: "asthma"
- Condition: "chronic obstructive lung disease"
- Condition: "medical illness"
- Qualifier: "acute"
- Qualifier: "chronic"
- Observation: "tobacco use"
- Observation: "nicotine use"
- Temporal: "last 60 days"
- Condition: "sickle cell trait"
- Condition: "sickle cell disease"
- Condition: "hereditary hematological abnormality"
- Condition: "acquired hematological abnormality"
- Condition: "fainting"
- Procedure: "phlebotomy"
- Condition: "adverse reaction"
- Observation: "donation of blood"
- Measurement: "QTc"
- Procedure: "electrocardiogram"
- Value: ">470 ms"
- Condition: "illicit drug abuse"
- Condition: "alcohol abuse"
- Condition: "HIV infection"
- Condition: "Hepatitis B infection"
- Condition: "Hepatitis C infection"
- Condition: "thrombophilia"
- Drug: "anticoagulant therapy"
- Condition: "Pregnancy"
- Measurement: "BMI"
- Condition: "Obesity"
- Value: ">30"
- Observation: "blood donation"
- Non-query-able: ") Single whole blood unit donation within the past 8 weeks; b) Double RBC donation by apheresis within the past 16 weeks; or c) Plasma donation by apheresis within the past 4 weeks"
- Observation: "RBC mass"
- Qualifier: "Inadequate"
- Measurement: "TBV"
- Value: "<4500 ml"
- Measurement: "Hb"
- Value: "<14 g/dL"